What is Hikikomori syndrome?

Hikikomori syndrome is a Japanese culture-bound syndrome and a serious social problem in Japan. It's a condition in which a subject locks himself/self into a house for a prolonged period of time for the period of 6 months or more, with no evident psychosis.